Clinical trial exclusion criterion:
Enrolment in any activity requiring a blood donation greater than 50 mL during the period starting 30 days before the first study visit (Day -83, Day -60 or Day -30) or for the duration of the study period.

Entity relations:
- Has_multiplier("blood donation", "greater than 50 mL")
- Has_index("during the period starting 30 days before the first study visit", "30 days before the first study visit")
- Has_index("for the duration of the study period", "the study period")
- Has_temporal("blood donation", "during the period starting 30 days before the first study visit")
- OR("during the period starting 30 days before the first study visit", "for the duration of the study period")